Clinical trial exclusion criterion:
4. Known elevated liver enzymes in past clinical trials with any compound (experimental or marketed)

Entity relations:
- Has_value("liver enzymes", "elevated")